Clinical trial inclusion criterion:
5. Able to swallow the liquid study drug.

Annotated entities:
- Non-representable: "Able to swallow the liquid study drug."
- Post-eligibility: "Able to swallow the liquid study drug."